Clinical trial inclusion criterion:
Must be in general good health as judged by the Investigator, based on medical history and physical examination.

Annotated entities:
- Non-query-able: "Must be in general good health as judged by the Investigator, based on medical history and physical examination"